Clinical trial inclusion criterion:
Medically fit for definitive surgical management of stone.

Entity relations:
- AND("definitive surgical management", "stone")
- Has_mood("definitive surgical management", "Medically fit for")